下列那一項是Streptococcus pyogenes的superantigen？
A. M-protein
B. F-protein
C. heat-labile toxin（speA）
D. Streptolysin S

正確答案：C. heat-labile toxin（speA）